Clinical trial exclusion criterion:
Anticipated survival of less than 3 months.

Entity relations:
- Has_value("Anticipated survival", "less than 3 months")